Patients with unstable occlusive disease (e.g., crescendo angina)

The above is a clinical trial exclusion criterion. Annotated with entity spans:
Patients with [Condition: unstable occlusive disease] (e.g., crescendo angina)